Clinical trial exclusion criterion:
Use of any investigational or non-registered product (drug or vaccine) other than the study vaccine(s) within 30 days preceding the first dose of study vaccine, or planned use during the study period

Entity relations:
- Subsumes("non-registered product any other than the study vaccine(s)", "drug")
- Has_temporal("planned use", "during the study period")
- Has_temporal("non-registered product any other than the study vaccine(s)", "within 30 days")
- AND("planned use", "drug")
- OR("non-registered product any other than the study vaccine(s)", "product any investigational other than the study vaccine(s)")
- OR("drug", "vaccine")
- OR("non-registered product any other than the study vaccine(s)", "planned use")